List symptoms of Heerfordt syndrome.

Heerfordt syndrome (also known as Heerfordt-Waldenström or uveoparotid fever)  is a rare presentation of sarcoidosis characterized by the presence of parotid gland enlargement, facial palsy, anterior uveitis, and fever.